Clinical trial inclusion criterion:
Subjects diagnosed of schizophrenia as defined by Diagnostic and Statistical Manual of Mental Disorders, 4th edition text revision or 5th edition (DSM-<U+2163>-TR or 5) criteria, and a history of illness for at least for 3 years prior to screening.

Annotated entities:
- Condition: "schizophrenia"
- Qualifier: "Diagnostic and Statistical Manual of Mental Disorders, 4th edition text revision or 5th edition (DSM-<U+2163>-TR or 5) criteria"
- Temporal: "history of illness"
- Multiplier: "for at least for 3 years"
- Temporal: "prior to screening"